抗酸性（acid-fast）菌的意義是：
A. 菌體在酸性環境中生長更加快速
B. 菌體會分泌抗酸性物質
C. 菌體被染色後不易被酸性酒精脫色
D. 菌體本身呈現酸性

正確答案：C. 菌體被染色後不易被酸性酒精脫色